Undergoing elective, primary and unilateral total knee arthroplasty

The above is a clinical trial inclusion criterion. Annotated with entity spans:
Undergoing [Qualifier: elective], [Qualifier: primary] and [Qualifier: unilateral] [Procedure: total knee arthroplasty]